Clinical trial exclusion criterion:
Another household member enrolled in the study

Annotated entities:
- Non-query-able: "Another household member enrolled in the study"